Clinical trial exclusion criterion:
Trial of < 2 AEDs

Entity relations:
- Has_multiplier("AEDs", "< 2")